一位 60 歲女性病人，因為意識障礙被送到急診室。病人血壓 90/60 mmHg，體溫 36℃，脈搏 50 次/ 分，眉毛稀疏，乳頭顏色極淡。實驗室檢查結果顯示血糖 50 mg/dL、血鈉 120 mmol/L、eosinophil count
A. Addison's disease
B. primary hypothyroidism
C. syndrome of inappropriate ADH secretion（SIADH）
D. Sheehan's syndrome

正確答案：D. Sheehan's syndrome